Clinical trial exclusion criterion:
Contraindications for BB.

Entity relations:
- AND("Contraindications", "BB")